腕關節（wrist joint）屬於下列何種關節？
A. 髁狀關節（condyloid joint）
B. 球窩關節（ball and socket joint）
C. 鞍型關節（saddle joint）
D. 屈戌關節（hinge joint）

正確答案：A. 髁狀關節（condyloid joint）